Clinical trial inclusion criterion:
Patients with an on-going agitation episode, or with a previous one within the 6 months prior to screening, attended and managed in the hospital setting.

Entity relations:
- Has_index("within the 6 months prior to screening", "screening")
- Has_temporal("agitation episode", "within the 6 months prior to screening")